Clinical trial exclusion criterion:
Known allergy/sensitivity or any hypersensitivity to components of study drugs or their formulation

Entity relations:
- AND("allergy", "components of study drugs")
- OR("allergy", "hypersensitivity", "sensitivity")